Clinical trial exclusion criterion:
Subjects on fetal hemoglobin inducing agents

Entity relations:
- multi("fetal hemoglobin inducing agents", "fetal")